Subject has insulin-dependent diabetes mellitus.

The above is a clinical trial exclusion criterion. Annotated with entity spans:
Subject has [Qualifier: insulin-dependent] [Condition: diabetes mellitus].